Clinical trial exclusion criterion:
HIV infection at screening

Annotated entities:
- Condition: "HIV infection"